下列何者是兒童肥胖的最佳預測指標？
A. 出生體重過重
B. 父母肥胖
C. 隔代教養
D. 單一子女

正確答案：B. 父母肥胖